鼻前部出血時，常發生在什麼位置？
A. 下鼻甲前端
B. 中鼻甲前端
C. 鼻中隔前端
D. 鼻前庭前端

正確答案：C. 鼻中隔前端